QTc >500 milliseconds on EKG at screening.

The above is a clinical trial exclusion criterion. Annotated with entity spans:
[Measurement: QTc] [Value: >500 milliseconds] on [Procedure: EKG] [Temporal: at screening].